All patients admitted at the Gynecological emergency Unit at Hospital de Clínicas de Porto Alegre scheduled for uterine evacuation with <12 weeks of gestation.

The above is a clinical trial inclusion criterion. Annotated with entity spans:
All patients admitted at the [Visit: Gynecological emergency Unit at Hospital de Clínicas de Porto Alegre] scheduled for [Procedure: uterine evacuation] with [Multiplier: <12 weeks] of [Condition: gestation].